Paciente de 46 años de edad, hipertenso y sin otros antecedentes patológicos de interés. Acude a consulta por presentar una tumoración anterior paraesternal izquierda no dolorosa de dos meses de evolución y sin otro síntoma añadido. A la exploración física se aprecia una masa dura de 4,5 x 4 cm, no dolorosa, sin retracción de la piel y adherida a planos profundos. ¿Cuál de estas afirmaciones es correcta?
1. Al tratarse de una masa anterior no dolorosa, se debe considerar un tumor benigno.
2. Como primera medida debe descartarse un tumor condroide dado que son los más frecuentes en esta localización.
3. No está indicada la realización de una biopsia por el peligro de diseminación local del tumor.
4. Es preferible mantener una actitud conservadora, evaluando la evolución y posible crecimiento de la tumoración.

Respuesta correcta: 2. Como primera medida debe descartarse un tumor condroide dado que son los más frecuentes en esta localización.